Chico de 23 años de edad, que al realizar un salto jugando al baloncesto, cae sobre su extremidad inferior derecha con la rodilla en hiperextensión aplicando un giro brusco a su rodilla mientras que mantiene el pie fijo en el suelo. El paciente, percibe un chasquido y dolor agudo en su rodilla, no pudiendo continuar jugando. Nota sensación de inestabilidad al realizar el apoyo de dicha extremidad. En la exploración clínica se aprecia derrame articular intenso por lo que se practica artrocentosis que muestra importante hemartrosis aguda sin presencia de gotitas de grasa sobrenadando en el líquido extraído. La movilidad de la rodilla está libre y la maniobra de Lachman resulta positiva. ¿Cuál es la sospecha diagnóstica?
1. Rotura en asa de cubo del menisco interno.
2. Rotura aislada del ligamento colateral lateral.
3. Fractura por arrancamiento de la espina tibial anterior.
4. Fractura unicondílea del cóndilo medial.
5. Rotura del ligamento cruzado anterior.

Respuesta correcta: 5. Rotura del ligamento cruzado anterior.